Clinical trial exclusion criterion:
Uncontrolled local or systemic diseases that affects wound healing (diabetes, autoimmune or inflammatory disorders)

Entity relations:
- Has_qualifier("systemic diseases", "Uncontrolled")
- Has_qualifier("systemic diseases", "that affects wound healing")
- Subsumes("systemic diseases", "diabetes")
- OR("systemic diseases", "diseases local")
- OR("diabetes", "autoimmune disorders", "inflammatory disorders")